Concomitant or previous malignancies with the exception of adequately treated basal cell or squamous cell skin cancer, in situ cervical cancer, incidental carcinoid, or other cancer from which the patient has been disease free for 5 years.

The above is a clinical trial exclusion criterion. Annotated with entity spans:
[Qualifier: Concomitant] or [Qualifier: previous] [Condition: malignancies] with [Negation: the exception of] [Qualifier: adequately treated] [Condition: basal cell] or [Condition: squamous cell skin cancer], [Condition: in situ cervical cancer], [Condition: incidental carcinoid], or [Condition: other cancer] from which the patient [Qualifier: has been disease free] [Temporal: for 5 years].